下列那一個病例不符合所列之動脈血氣體分析和血清電解質的檢查結果？pH 7.49，PaO2 90 mmHg， PaCO2 48 mmHg，HCO3- 32 mEq/L；Na+ 140，K+ 2.7，Cl- 92（電解質的單位是 mmol/L）
A. 40 歲甲病人，血壓 160/108 mmHg，血漿腎素活性 0.12 ng/mL/hr（正常值 1.0-3.5 ng/mL/hr）
B. 20 歲乙女性，使用利尿劑（hydrochlorothiazide）減重
C. 40 歲丙病人，血壓 162/102 mmHg，長期食用甘草（licorice）
D. 60 歲丁病人使用 acetazolamide 治療青光眼

正確答案：D. 60 歲丁病人使用 acetazolamide 治療青光眼